Clinical trial exclusion criterion:
severe hepatic insufficiency or paracetamol (acetaminophen) is contraindicated for other reason

Entity relations:
- Subsumes("paracetamol", "acetaminophen")
- AND("contraindicated", "paracetamol")
- Has_qualifier("hepatic insufficiency", "severe")
- OR("hepatic insufficiency", "contraindicated")